Which class of genes are mutated in Diamond Blackfan Anemia patients?

Small ribosomal subunit genes RPS19, RPS24, and RPS17 are mutated in approximately one-third of patients. Currently two genes are associated with the DBA phenotype--the ribosomal protein (RP) S19 mutated in 25% of DBA patients and RPS24 mutated in approximately 1.4% of DBA patients. As a proof of concept, we designed a multiplex ligation-dependent probe amplification assay targeted to screen the six genes that are most frequently mutated in Diamond-Blackfan anemia patients: RPS17, RPS19, RPS26, RPL5, RPL11, and RPL35A. We sequenced GATA-1 in 23 patients that were negative for mutations in the most frequently mutated DBA genes. Currently nine genes, all encoding ribosomal proteins (RP), have been found mutated in approximately 50% of patients. More than a decade has passed since the initial identification of ribosomal protein gene mutations in patients with Diamond-Blackfan anemia (DBA), a hematologic disorder that became the founding member of a class of diseases known as ribosomopathies. In this study, nine Korean DBA patients were screened for mutations in eight known DBA genes (RPS19, RPS24, RPS17, RPS10, RPS26, RPL35A, RPL5 and RPL11) using the direct sequencing method.